hemodialysis or peritoneal dialysis

The above is a clinical trial exclusion criterion. Annotated with entity spans:
[Procedure: hemodialysis] or [Procedure: peritoneal dialysis]